Los filtros de vidrio poroso de 10-40µm se emplean de modo especial en:
1. Filtración análitica.
2. Filtración fina.
3. Ayuda para otros materiales filtrantes.
4. Filtración ultrafina.
5. Separación de microorganismos de gran diámetro.

Respuesta correcta: 1. Filtración análitica.